Clinical trial inclusion criterion:
Age greater than or equal to 18 years old

Entity relations:
- Has_value("Age", "greater than or equal to 18 years old")